Clinical trial exclusion criteria:
Patients who are unwilling to participate in the study. For the one under guardianship, the refusal of the patient will be the final decision even if the guardian is willing to participate.
Subjects who are unlikely to adhere to the study an/or poor adherence anticipated by the investigator.
Un-controlled progressive pathology.
Osteoarticular lesion which contraindicates part of the rehabilitation involved in the study.
Patients with other interventions planned prior to the end of the study period (orthosis, surgery etc.).
Surgery to the treated limb less than 6 months previously.
Pregnant woman.

Annotated entities:
- Post-eligibility: "Patients who are unwilling to participate in the study. For the one under guardianship, the refusal of the patient will be the final decision even if the guardian is willing to participate"
- Post-eligibility: "Subjects who are unlikely to adhere to the study an/or poor adherence anticipated by the investigator"
- Non-query-able: "Un-controlled progressive pathology"
- Condition: "Osteoarticular lesion"
- Non-query-able: "Osteoarticular lesion which contraindicates part of the rehabilitation involved in the study"
- Non-query-able: "Patients with other interventions planned prior to the end of the study period (orthosis, surgery etc.)"
- Procedure: "Surgery"
- Qualifier: "treated limb"
- Temporal: "less than 6 months"
- Pregnancy_considerations: "Pregnant woman"